Clinical trial exclusion criterion:
potassium > 6 mg/dl

Annotated entities:
- Measurement: "potassium"
- Value: "> 6 mg/dl"